Clinical trial inclusion criterion:
Age = 50

Entity relations:
- Has_value("Age", "= 50")